List drugs withdrawn from the market for cardiovascular adverse events.

Over the years, a number of different drugs have been withdrawn for Cardiotoxicity. Drugs like Clobutinol, that  induce cardiac arrhythmias by a blockade of the potassium channel coded by the hERG channel, sibutramine for weight loss and Cox2 inhibitors, Rofecoxib and Valdecoxib have been withdrawn from the market.